Subjects undergoing a single level lumbar decompression and fusion

The above is a clinical trial inclusion criterion. Annotated with entity spans:
Subjects undergoing a [Qualifier: single level] [Procedure: lumbar decompression] and fusion